regular consumption of medication with potential hepatotoxicity.

The above is a clinical trial exclusion criterion. Annotated with entity spans:
regular consumption of [Drug: medication] with potential [Condition: hepatotoxicity].